How is the sequence variability defined in antibodies?

The variability at each position of the polypeptide chain is defined as:
Variability = number of different amino acids at a given position / frequency of the  most common amino acid at given position.